Una valoración culombimétrica:
1. No necesita que el rendimiento en corriente sea del 100%.
2. No necesita de un sistema indicador del punto final.
3. Utiliza siempre un sistema potenciostático.
4. Utiliza un agente valorante que se genera electrolíticamente.
5. Necesita de una bureta para añadir el agente valorante.

Respuesta correcta: 4. Utiliza un agente valorante que se genera electrolíticamente.